病人上臂骨折後出現手腕無法伸展現象，下列那一條神經最可能受傷？
A. 正中神經
B. 腋神經
C. 尺神經
D. 橈神經

正確答案：D. 橈神經